一名3歲男孩因為跌倒後大腿骨折而住院，身體診察發現有藍色鞏膜（blue sclera），部分皮膚呈現瘀青斑（bruising spots），全身關節亦較鬆弛，影像檢查顯示下肢長骨（long bone）輕度彎曲並有骨折舊傷與骨質疏鬆（osteoporosis, Z score: -3.0），血中鈣及磷離子濃度正常，家族史中母親也有藍色鞏膜及青春期前重覆骨折病史，關於此病童所罹患的疾病，下列敘述何者最不正確？
A. 它是第一型膠原蛋白（type I collagen）質量缺陷所致的易碎骨頭症（brittle bone disease）
B. 雙磷酸鹽（bisphosphonate）有增進造骨母細胞（osteoblast）功能改善骨質密度並減少	 骨折
C. 它是一種以體染色體顯性方式遺傳的結締組織疾病，常合併身材矮小或早發性聽力障礙
D. 此疾病患者病程預後主要與是否有反覆肺炎或心肺血管功能異常程度有關

正確答案：B. 雙磷酸鹽（bisphosphonate）有增進造骨母細胞（osteoblast）功能改善骨質密度並減少	 骨折